Patients must not have active local-regional disease prior to registration.

The above is a clinical trial inclusion criterion. Annotated with entity spans:
Patients must [Negation: not] have [Temporal: active] [Condition: local-regional disease] prior to registration.